Participants with light chain and free light chain (FLC) only may be enrolled if they meet all the criteria for a diagnosis of MM.

The above is a clinical trial inclusion criterion. Annotated with entity spans:
Participants with [Condition: light chain and free light chain (FLC)] only may be enrolled if they meet [Value: all] the [Measurement: criteria for a diagnosis of MM].